Clinical trial exclusion criterion:
(4) Female subjects who agreed to abstinence during the clinical trial period.

Annotated entities:
- Pregnancy_considerations: "Female subjects who agreed to abstinence during the clinical trial period"